髖關節置換術（total hip replacement）後復健過程中，下列敘述何者錯誤？
A. 避免翹二郎腿
B. 座椅越低越好
C. 馬桶座墊須提高
D. 手術後三個月內不要騎自行車

正確答案：B. 座椅越低越好